patients with cervical incompetence;

The above is a clinical trial exclusion criterion. Annotated with entity spans:
patients with [Condition: cervical incompetence];